bariatric surgery patients

The above is a clinical trial inclusion criterion. Annotated with entity spans:
[Procedure: bariatric surgery] patients